Clinical trial exclusion criterion:
Weight-loss of >5kg in the preceding 6 months

Entity relations:
- Has_value("Weight-loss", ">5kg")
- Has_temporal("Weight-loss", "preceding 6 months")